檢查病患時，聞到鼻腔內有臭味，下列何者最不可能？
A. 萎縮性鼻炎
B. 鼻癌或鼻竇癌
C. 下鼻甲肥厚
D. 鼻道內異物

正確答案：C. 下鼻甲肥厚